Clinical trial exclusion criterion:
Severe malnutrition (weight-for-height Z-score <-3)

Annotated entities:
- Condition: "malnutrition"
- Qualifier: "Severe"
- Measurement: "weight-for-height Z-score"
- Value: "<-3"